Clinical trial exclusion criterion:
Concomitant treatment with high doses of acetylsalicylic acid (> 500 mg/day) or continuous treatment with non-steroidal anti-inflammatory drugs

Entity relations:
- Subsumes("high doses", "> 500 mg/day")
- Has_multiplier("acetylsalicylic acid", "high doses")
- AND("treatment", "acetylsalicylic acid")
- Has_temporal("treatment", "Concomitant")
- AND("treatment", "non-steroidal anti-inflammatory drugs")
- Has_temporal("treatment", "continuous")
- OR("treatment", "treatment")